What is the effect of the alleles CYP2C19*2 and CYP2C19*3 on CYP2C19 function?

The CYP2C19*2 and CYP2C19*3 alleles of CYP2C19 are associated with loss-of-function (LOF).